substance misuse other contraindication to used study drugs no informed consent

The above is a clinical trial exclusion criterion. Annotated with entity spans:
[Condition: substance misuse] other [Condition: contraindication] to used [Drug: study drugs] no informed consent